Clinical trial exclusion criterion:
Is pregnant, planning pregnancy or breast feeding (female subjects of childbearing potential must have negative pregnancy test prior to vaccination).

Entity relations:
- multi("vaccination", "vaccination")
- AND("prior to vaccination", "vaccination")
- Has_temporal("pregnancy test", "prior to vaccination")
- Has_value("pregnancy test", "negative")
- AND("female", "pregnancy test")
- Has_index("prior to vaccination", "vaccination")
- AND("childbearing potential", "pregnancy test")
- OR("pregnant", "planning pregnancy", "breast feeding")